Clinical trial exclusion criterion:
4. Other medical complications that might preclude one from participating in the study, i.e., recent heart attack or stroke or chronic kidney disease.

Annotated entities:
- Condition: "heart attack"
- Temporal: "recent"
- Condition: "stroke"
- Condition: "chronic kidney disease"
- Qualifier: "Other"
- Condition: "medical complications"
- Negation: "preclude"
- Informed_consent: "participating in the study"